9. Intention to treat more than 1 totally occluded major epicardial vessel;

The above is a clinical trial exclusion criterion. Annotated with entity spans:
9. [Mood: Intention to] [Procedure: treat] [Multiplier: more than 1] [Qualifier: totally occluded major epicardial vessel];